En el ciclo de la urea:
1. Las enzimas que participan se localizan en la mitocondria.
2. Los defectos genéticos se pueden trata con benzoato.
3. Un     metabolito    intermediario      es  el N-acetilglutamato.
4. Se sintetiza lisina.
5. Interviene la carbamilfosfato sintetasa II.

Respuesta correcta: 2. Los defectos genéticos se pueden trata con benzoato.